ALT and AST <2.5 × ULN; liver metastases, if any, the ALT and AST<5 × ULN

The above is a clinical trial inclusion criterion. Annotated with entity spans:
[Measurement: ALT] and [Measurement: AST] [Value: <2.5 × ULN]; [Condition: liver metastases], if any, the [Measurement: ALT] and [Measurement: AST][Value: <5 × ULN]